Clinical trial inclusion criterion:
Subjects were to have no clinically significant abnormal findings on physical examination, ECG, medical history, or clinical laboratory results during screening.

Entity relations:
- Has_negation("abnormal findings", "no")
- Has_qualifier("abnormal findings", "clinically significant")
- Has_temporal("abnormal findings", "during screening")
- AND("abnormal findings", "physical examination")
- OR("physical examination", "clinical laboratory", "ECG", "medical history")